有關小孩隱睪症（cryptorchidism）的敘述，下列何者錯誤？
A. 使用荷爾蒙治療只有 20%的成功率，而且與隱睪的位置有關
B. 隱睪症手術的最佳時機在 1～3 歲之間
C. 兩側隱睪症的小孩應進一步進行染色體評估，以期發現性別異常的情形
D. 放射線學檢查以測定隱睪位置不是絕對需要，並不會影響手術的進行

正確答案：B. 隱睪症手術的最佳時機在 1～3 歲之間